一位 64 歲女性，發現右眼上眼瞼有一無痛、逐漸變大之腫塊，有八個月之久。並且，此腫塊曾接受過二次切開刮除術。檢查右眼上眼瞼，可見眼瞼緣變形且睫毛掉落。此病例最可能之診斷是什麼？
A. 基底細胞癌（basal cell carcinoma）
B. 鱗狀細胞癌（squamous cell carcinoma）
C. 皮脂腺癌（sebaceous gland carcinoma）
D. 惡性黑素瘤（malignant melanoma）

正確答案：C. 皮脂腺癌（sebaceous gland carcinoma）